Clinical trial inclusion criterion:
Total bilirubin ≤ 1.5 X the upper limit of normal (ULN) unless a known history of impaired bilirubin conjugation such as Gilbert's, for whom the maximum will be 2.5 ULN.

Annotated entities:
- Measurement: "Total bilirubin"
- Value: "≤ 1.5 X the upper limit of normal (ULN)"
- Condition: "impaired bilirubin conjugation"
- Condition: "Gilbert's"
- Value: "maximum 2.5 ULN"